相較於維持姿勢的背部肌，下列有關操作精細動作的手指肌肉之敘述，何者正確？
A. 氧化能力（oxidative capacity）較高
B. 肌凝蛋白ATP酶（myosin ATPase）的活性較高
C. I型肌纖維（type I fibers）較多
D. 紅肌（red muscles）較多

正確答案：B. 肌凝蛋白ATP酶（myosin ATPase）的活性較高